endometrial hyperplasia with atypia,

The above is a clinical trial exclusion criterion. Annotated with entity spans:
[Condition: endometrial hyperplasia] with [Condition: atypia],